Clinical trial exclusion criterion:
Known or suspected congenital or acquired immunodeficiency; or receipt of immunosuppressive therapy, such as anti-cancer chemotherapy or radiation therapy, within the preceding 6 months; or long-term systemic corticosteroid therapy (prednisone or equivalent for more than 2 consecutive weeks within the past 3 months)

Entity relations:
- Has_multiplier("systemic corticosteroid therapy", "long-term")
- Has_temporal("prednisone", "for more than 2 consecutive weeks")
- Has_temporal("prednisone", "within the past 3 months")
- Subsumes("systemic corticosteroid therapy", "prednisone")
- Subsumes("immunosuppressive therapy", "anti-cancer chemotherapy")
- Has_temporal("immunosuppressive therapy", "within the preceding 6 months")
- Has_context("congenital immunodeficiency", "Known")
- OR("anti-cancer chemotherapy", "radiation therapy")
- OR("Known", "suspected")
- OR("congenital immunodeficiency", "acquired immunodeficiency")
- OR("congenital immunodeficiency", "immunosuppressive therapy", "systemic corticosteroid therapy")